American Society of Anesthesiologists (ASA) 1-3 patients undergoing primary total hip arthroplasty

The above is a clinical trial inclusion criterion. Annotated with entity spans:
[Measurement: American Society of Anesthesiologists] ([Measurement: ASA]) [Value: 1-3] patients undergoing [Procedure: primary total hip arthroplasty]